Clinical trial exclusion criteria:
Allergy to ascorbic acid
Asthma
COPD
Allergy to opioids
Previous history of chemical dependence
Prior cardiac surgery
Known hyperoxaluria
History of renal calculi
History of allergic or hypersensitivity reaction to ascorbic acid products
Currently taking 1 g or more of ascorbic acid supplementation daily

Annotated entities:
- Drug: "ascorbic acid"
- Condition: "Allergy"
- Condition: "Asthma"
- Condition: "COPD"
- Condition: "Allergy"
- Drug: "opioids"
- Condition: "chemical dependence"
- Temporal: "history"
- Temporal: "Previous"
- Procedure: "cardiac surgery"
- Temporal: "Prior"
- Condition: "hyperoxaluria"
- Condition: "renal calculi"
- Temporal: "History"
- Condition: "allergic"
- Condition: "hypersensitivity"
- Drug: "ascorbic acid"
- Multiplier: "1 g or more"
- Drug: "ascorbic acid"